1. Does not have a documented history of generalized seizures.

The above is a clinical trial exclusion criterion. Annotated with entity spans:
[Parsing_Error: 1.] Does [Negation: not] have a documented [Temporal: history] of [Condition: generalized seizures].